Clinical trial exclusion criterion:
Serum Cr > 2.0 mg/dL

Entity relations:
- Has_value("Serum Cr", "> 2.0 mg/dL")